下列何者受到傷害，最可能造成病人口咽處黏膜一般感覺缺失？
A. 迷走神經（vagus nerve）
B. 舌咽神經（glossopharyngeal nerve）
C. 頸襻（ansa cervicalis）
D. 喉返神經（recurrent laryngeal nerve）

正確答案：B. 舌咽神經（glossopharyngeal nerve）